Has received prior immunotherapy with an anti-Programmed Cell Death Receptor 1 (PD-1), Programmed Cell Death Receptor Ligand 1 (anti-PD-L1), or anti- Programmed Cell Death Receptor Ligand 2 (PD-L2) or has previously participated in clinical studies with pembrolizumab

The above is a clinical trial exclusion criterion. Annotated with entity spans:
Has received prior [Procedure: immunotherapy] with an [Drug: anti-Programmed Cell Death Receptor 1 (PD-1)], [Drug: Programmed Cell Death Receptor Ligand 1 (anti-PD-L1)], or [Drug: anti- Programmed Cell Death Receptor Ligand 2 (PD-L2)] or has previously [Non-query-able: participated in clinical studies with pembrolizumab]